下列那種病人比較不會有弱視（amblyopia）？
A. 右眼內斜視（esotropia）
B. 遠視性兩眼不等視（anisometropia）
C. 單眼先天性白內障（congenital cataract）
D. 間歇性外斜視（intermittent exotropia）

正確答案：D. 間歇性外斜視（intermittent exotropia）